下列關於流行性感冒病毒（Influenza virus）變異之敘述，何者為錯？
A. 所謂抗原大變異（antigenic shift）是指不同病毒株之各段 RNA 基因體間的交換所造成的變異
B. 抗原大變異是造成流行性感冒病毒每年流行的主要原因
C. 所謂抗原小變異（antigenic drift）是指其 RNA 基因體本身點突變（point mutation）所造成的變異
D. 抗原小變異是造成每年流行性感冒病毒株之間有不同的主要原因

正確答案：B. 抗原大變異是造成流行性感冒病毒每年流行的主要原因